Known hypersensitivity to chloroprocaine (a.k.a. Ester allergy), paraaminobenzoic acid (PABA) or bupivacaine (a.k.a. Amide allergy)

The above is a clinical trial exclusion criterion. Annotated with entity spans:
Known [Condition: hypersensitivity] to [Drug: chloroprocaine] (a.k.a. [Condition: Ester allergy]), [Drug: paraaminobenzoic acid] ([Drug: PABA]) or [Drug: bupivacaine] (a.k.a. [Condition: Amide allergy])